您為一位 55 歲沒有運動習慣的男性規劃每週三次的慢跑運動，計畫以最大心跳速率的 60%為第一週運動時的目標，您建議的目標心跳速率是多少？
A. 87 次/分鐘
B. 99 次/分鐘
C. 117 次/分鐘
D. 105 次/分鐘

正確答案：B. 99 次/分鐘